Tourette syndrome

The above is a clinical trial exclusion criterion. Annotated with entity spans:
[Condition: Tourette syndrome]